62歲女性，有多年的腸胃症狀，內視鏡檢查發現有萎縮性胃炎（atrophic gastritis），特別是在體部較嚴重，血清學檢查發現有抗壁細胞抗體（anti-parietal cell antibody），此病人同時有貧血。她的貧血最可能是：
A. 惡性貧血（pernicious anemia）
B. 再生不良性貧血（aplastic anemia）
C. 溶血性貧血（hemolytic anemia）
D. 缺鐵性貧血（iron deficiency anemia）

正確答案：A. 惡性貧血（pernicious anemia）